Has a spectacle cylinder ≥1.00D of cylinder in either eye.

The above is a clinical trial exclusion criterion. Annotated with entity spans:
Has a [Device: spectacle cylinder] [Value: ≥1.00D] of cylinder in either eye.